ECOG performance status < 2

The above is a clinical trial inclusion criterion. Annotated with entity spans:
[Measurement: ECOG performance status] [Value: < 2]